Clinical trial exclusion criterion:
Regular use of any nonsteroidal antiinflammatory drug,

Entity relations:
- Has_multiplier("nonsteroidal antiinflammatory drug", "Regular use")